下列何種抗憂鬱藥物不屬於選擇性血清素再回收抑制劑？
A. Fluoxetine
B. Sertraline
C. Bupropion
D. Citalopram

正確答案：C. Bupropion